Clinical trial inclusion criterion:
All adult patients with chronic myeloid leukaemia in any phase (chronic, accelerated or blastic) who undergo allogeneic stem cell transplantation between 01/01/2010 and 30/09/2013 and have been previously treated with Nilotinib or Dasatinib, regardless of their response to these drugs.

Entity relations:
- Has_temporal("Nilotinib", "previously")
- Has_temporal("allogeneic stem cell transplantation", "between 01/01/2010 and 30/09/2013")
- Has_qualifier("chronic myeloid leukaemia", "any phase")
- Subsumes("any phase", "chronic")
- OR("Nilotinib", "Dasatinib")
- OR("chronic", "accelerated", "blastic")